腰椎椎管狹窄（lumbar spinal stenosis）在何種姿勢時會使神經性跛行症狀減緩？
A. 腰椎伸直（Extension）
B. 腰椎彎曲（Flexion）
C. 腰椎往側彎曲（lateral bending）
D. 直立（standing）

正確答案：B. 腰椎彎曲（Flexion）